下列何種藥物，最適合用於治療手術後尿滯留？
A. Atropine
B. Bethanechol
C. Pilocarpine
D. Rivastigmine

正確答案：B. Bethanechol